有關血脂質的代謝，下列敘述何者最正確？
A. 最大的脂蛋白分子為非常低密度脂蛋白（very-low-density lipoprotein）
B. Apolipoprotein是脂蛋白分子上的蛋白質，與血脂質的代謝有關
C. 乳糜粒（chylomicron）在肝臟內形成，其蛋白質成分為apolipoprotein B-48
D. 胰島素阻抗會使血脂質代謝異常，血中的高密度脂蛋白會上升

正確答案：B. Apolipoprotein是脂蛋白分子上的蛋白質，與血脂質的代謝有關